Clinical trial inclusion criterion:
Between the ages of 21-60

Entity relations:
- Has_value("ages", "Between 21-60")